Clinical trial inclusion criterion:
Resolution of all acute toxic effects of prior anti-cancer therapy or surgical procedures to NCI CTCAE version 4.0 grade = 1 (except alopecia or other toxicities not considered a safety risk for the patient at investigator's discretion).

Entity relations:
- Has_value("NCI CTCAE version 4.0", "grade = 1")
- Has_qualifier("anti-cancer therapy", "prior")
- Has_context("acute toxic effects", "Resolution")
- AND("acute toxic effects", "anti-cancer therapy")
- AND("acute toxic effects", "NCI CTCAE version 4.0")
- OR("anti-cancer therapy", "surgical procedure")